一位 40 歲男性病人至門診就醫，主訴一週以來有持續性下腹痛及尿液混濁並夾雜氣泡，且有輕微之排尿困難，但無血便之症狀。理學檢查只見下腹及左下腹壓痛，但並無反彈性壓痛。有輕微發燒 （38℃），白血球 14,000/mm3，尿液中有雜質及多量 WBC 但只有少量 RBC。經詢問病人，在過去
 年內即經常有左下腹痛及便秘之現象，但並無解血便或血尿的情況，則病人最可能的診斷是：
A. 膀胱腫瘤
B. 膀胱結石
C. 大腸憩室炎
D. 大腸直腸癌

正確答案：C. 大腸憩室炎